Clinical trial exclusion criteria:
History of morphine allergy
History of bupivacaine allergy
Contraindication for ketamine infusion
Contraindication for thoracic paravertebral block
Anticipated postoperative positive pressure ventilation
Body mass index more than 35
Any known psychiatric disorder

Annotated entities:
- Drug: "morphine"
- Condition: "allergy"
- Temporal: "History"
- Drug: "bupivacaine"
- Condition: "allergy"
- Temporal: "History"
- Condition: "Contraindication"
- Drug: "ketamine"
- Procedure: "ketamine infusion"
- Condition: "Contraindication"
- Qualifier: "thoracic"
- Procedure: "paravertebral block"
- Temporal: "postoperative"
- Procedure: "positive pressure ventilation"
- Mood: "Anticipated"
- Measurement: "Body mass index"
- Value: "more than 35"
- Condition: "psychiatric disorder"